Clinical trial exclusion criterion:
Medical history of hypersensitivity to the components of the investigational products. (The components of test drug 1 and 2, including the Rhein-based drug)

Annotated entities:
- Condition: "hypersensitivity"
- Drug: "components of the investigational products"
- Drug: "components of test drug 1"
- Drug: "components of test drug 2"
- Drug: "Rhein-based drug"